Clinical trial exclusion criterion:
1. Patient with equivocal diagnosis of rupture of membranes

Entity relations:
- Has_negation("rupture of membranes", "equivocal")